Clinical trial exclusion criterion:
The pregnant or lactating woman

Entity relations:
- OR("pregnant", "lactating")